Clinical trial inclusion criterion:
Currently residing in Manitoba

Entity relations:
- AND("Currently residing", "Manitoba")